Clinical trial exclusion criterion:
Fasting triglycerides greater than 400 mg/dL.

Entity relations:
- Has_value("Fasting triglycerides", "greater than 400 mg/dL")